Clinical trial inclusion criterion:
Women with expected difficult IUD insertion like nulliparous women and women with previous cesarean section.

Entity relations:
- Has_qualifier("IUD insertion", "difficult")
- Has_mood("IUD insertion", "expected")
- Has_temporal("cesarean section", "previous")
- Subsumes("IUD insertion", "nulliparous")
- OR("nulliparous", "women")
- OR("women", "women")